Clinical trial exclusion criterion:
Clinically significant hepatic or renal disorder.

Entity relations:
- Has_qualifier("hepatic disorder", "Clinically significant")
- OR("hepatic disorder", "renal disorder")